Clinical trial exclusion criterion:
Daily use of pain killers

Annotated entities:
- Drug: "pain killers"
- Multiplier: "Daily"